Fertile males unwilling to use contraception

The above is a clinical trial exclusion criterion. Annotated with entity spans:
[Non-query-able: Fertile males unwilling to use contraception]